Bleeding disorders.

The above is a clinical trial exclusion criterion. Annotated with entity spans:
[Condition: Bleeding disorders].